Clinical trial inclusion criterion:
8. Negative pregnancy test (if female of childbearing potential)

Entity relations:
- Has_value("pregnancy test", "Negative")
- AND("childbearing potential", "pregnancy test")
- AND("female", "pregnancy test")